Clinical trial exclusion criterion:
Atrio-ventricular conduction disturbances

Annotated entities:
- Condition: "Atrio-ventricular conduction disturbances"